Clinical trial inclusion criterion:
Concomitant use of potent CYP3A4 inhibitors (atazanavir, clarithromycin, indinavir, itraconazole, ketoconazole, nefazodone, nelfinavir, ritonavir, saquinavir, telithromycin and voriconazole) or inducers (carbamazepine, dexamethasone, phenobarbital, phenytoin, rifampin, and rifapentine)

Entity relations:
- Subsumes("potent CYP3A4 inducers", "carbamazepine")
- Subsumes("potent CYP3A4 inhibitors", "atazanavir")
- Has_temporal("potent CYP3A4 inducers", "Concomitant")
- Has_temporal("potent CYP3A4 inhibitors", "Concomitant")
- OR("atazanavir", "clarithromycin", "indinavir", "itraconazole", "ketoconazole", "nefazodone", "nelfinavir", "ritonavir", "saquinavir", "telithromycin", "voriconazole")
- OR("carbamazepine", "dexamethasone", "phenobarbital", "phenytoin", "rifampin", "rifapentine")